下列何種修補作用不能修復紫外光所造成的嘧啶二聚體（pyrimidine dimers）傷害？
A. 核苷酸切除修復（nucleotide excision repair）
B. DNA 光解酶（DNA photolyases）
C. 核酸錯誤配對修復（mismatch repair）
D. 鹼基切除修復（base excision repair）

正確答案：C. 核酸錯誤配對修復（mismatch repair）